下列何者不是毒殺性T細胞（cytotoxic T lymphocyte，CTL）能專一性毒殺標的細胞的原因？
A. CTL需利用TCR辨認標的細胞是否有表現專一性抗原胜肽/MHC class I複合物
B. CTL利用TCR辨認出標的細胞後，其將要分泌出去的內容物顆粒會移至CTL與標的細胞接
C. CTL利用TCR辨認出標的細胞後，可以利用FasL與標的細胞的Fas結合，引發標的細胞的凋亡
D. CTL可以分泌IL-12來幫助細胞抑制病毒的複製

正確答案：D. CTL可以分泌IL-12來幫助細胞抑制病毒的複製